Clinical trial inclusion criterion:
Failure of medical treatment or rehabilitation.

Annotated entities:
- Qualifier: "Failure"
- Procedure: "medical treatment"
- Procedure: "rehabilitation"